腦中風病人單側咽部無力（pharyngeal weakness）的患者，最常使用下列何種姿勢進行吞嚥？
A. 頭轉向患側
B. 頭轉向健側
C. 仰頭進食
D. 低頭進食

正確答案：A. 頭轉向患側